Clinical trial exclusion criterion:
Previous treatment with CPAP

Annotated entities:
- Temporal: "Previous"
- Procedure: "treatment"
- Device: "CPAP"